Para muestras de tamaño n grande, la proporción muestral p^ sigue aproximadamente una distribución normal con esperanza p (la proporción poblacional) y ¿qué varianza?:
1. p.
2. p/n.
3. p(1-p).
4. p(1-p)/n.

Respuesta correcta: 4. p(1-p)/n.